有關中華肝吸蟲之敘述，下列何者正確？(1)在台灣主要流行於台東山地地區 	(2)不論海水或淡水之生魚片皆可能含有感染源 	(3)輕度感染時，肝功能檢查可能正常 	(4) 確切實驗室檢查之檢體為糞便及十二指腸液
A. (1)(2)
B. (1)(3)
C. (2)(3)
D. (3)(4)

正確答案：D. (3)(4)